Clinical trial exclusion criterion:
implanted hardware or other material that would prohibit treatment planning or delivery

Annotated entities:
- Non-query-able: "implanted hardware or other material that would prohibit treatment planning or delivery"